Newborns of substance abusing mothers.

The above is a clinical trial exclusion criterion. Annotated with entity spans:
[Person: Newborns] of [Condition: substance abusing] [Person: mothers].